What is the phenomenon described as "complex coacervation"?

Charge-mediated phase separation, or complex coacervation, of RNAs with cationic peptides can generate simple model liquid organelles capable of reversibly compartmentalizing biomolecules. The addition of PEG decreased both the amount of spermine required for phase separation and the coacoration temperature (TC).